ASA class 1-4

The above is a clinical trial inclusion criterion. Annotated with entity spans:
[Measurement: ASA class] [Value: 1-4]